Clinical trial exclusion criterion:
known for dexmedetomidine or other drugs allergy in this study.

Entity relations:
- Has_qualifier("drugs", "other")
- AND("allergy", "dexmedetomidine")
- OR("dexmedetomidine", "drugs")